王先生剛從泰國旅遊回來，發生高燒、帶血的黏液狀大便、全身倦怠不適、腹痛與裏急後重（tenesmus） 的症狀，此時最適當的初步處置方式是：
A. 給予水分補充、退燒及抑制胃腸蠕動的藥物（antispasmodics）
B. 給予抗生素及抑制胃腸蠕動藥物
C. 給予水分補充、退燒、休息、糞便的白血球檢查及糞便的細菌培養
D. 安排大腸鏡（colonoscopy）檢查

正確答案：C. 給予水分補充、退燒、休息、糞便的白血球檢查及糞便的細菌培養